What is an operon?

An operon is a group of genes linked together in a linear fashion and producing polycistronic mRNA.